Significant history of drug abuse disorder (including alcohol, as defined in DSM-5 substance use disorder or in the opinion of the investigator) within the last 6 months prior to screening.

The above is a clinical trial exclusion criterion. Annotated with entity spans:
[Intoxication_considerations: Significant history of drug abuse disorder (including alcohol, as defined in DSM-5 substance use disorder or in the opinion of the investigator) within the last 6 months prior to screening.]